軀幹及肢體皮膚呈現 café-au-lait 斑點，是下列何種疾病的特徵？
A. neurofibromatosis
B. Addison disease
C. Sturge-Weber disease
D. von Hippel-Lindau disease

正確答案：A. neurofibromatosis